participation in another study within 6 months prior.

The above is a clinical trial exclusion criterion. Annotated with entity spans:
[Competing_trial: participation in another study within 6 months prior.]